adalimumab（Humira）為一種抗腫瘤壞死因子（anti-TNF）之單株抗體，最不建議用於治療下列何種疾病？
A. Crohn's disease
B. ankylosing spondylitis
C. rheumatoid arthritis
D. systemic lupus eryhematosus

正確答案：D. systemic lupus eryhematosus